Clinical trial exclusion criterion:
Subjects were to have no history of known hypersensitivity or idiosyncratic reaction to the study drug or related compounds.

Annotated entities:
- Condition: "hypersensitivity"
- Condition: "idiosyncratic reaction"
- Drug: "study drug"
- Negation: "no"